Clinical trial inclusion criterion:
8. Left ventricular ejection fraction should be at least 30%.

Annotated entities:
- Measurement: "Left ventricular ejection fraction"
- Value: "at least 30%"